Clinical trial inclusion criterion:
Age equal or superior to 18 years;

Entity relations:
- Has_value("Age", "equal or superior to 18 years")